Current use of a third generation beta-blocker (nebivolol, carvedilol, or labetalol) or high dose of any beta-blockers (greater than 100 mg daily of metoprolol, or equivalent)

The above is a clinical trial exclusion criterion. Annotated with entity spans:
Current use of a [Drug: third generation beta-blocker] ([Drug: nebivolol], [Drug: carvedilol], or [Drug: labetalol]) or [Multiplier: high dose] of [Drug: any beta-blockers] ([Multiplier: greater than 100 mg daily] of [Drug: metoprolol], or equivalent)